Clinical trial inclusion criterion:
Male and female aged =19 and < 65 years.

Annotated entities:
- Person: "Male"
- Person: "female"
- Person: "aged"
- Value: "=19 and < 65 years"